Clinical trial exclusion criterion:
4. Received an investigational drug in the 30 days prior to the screening for this study

Annotated entities:
- Parsing_Error: "4."
- Temporal: "in the 30 days prior to the screening"
- Reference_point: "the screening"
- Drug: "investigational drug"